Clinical trial exclusion criterion:
Alanine aminotransferase (ALT) or aspartate aminotransferase (AST) > 3 times upper limit of normal (ULN)

Annotated entities:
- Measurement: "Alanine aminotransferase (ALT)"
- Measurement: "aspartate aminotransferase (AST)"
- Value: "> 3 times upper limit of normal (ULN)"